腕隧道症候群（carpal tunnel syndrome）是那一條神經穿過手腕隧道時，神經受到壓迫所造成的症狀？
A. 尺神經（ulnar nerve）
B. 橈神經（radial nerve）
C. 正中神經（median nerve）
D. 肌皮神經（musculocutaneous nerve）

正確答案：C. 正中神經（median nerve）